Clinical trial exclusion criterion:
multiple pregnancy

Annotated entities:
- Condition: "multiple pregnancy"